La gran diversidad de inmunoglobulinas se debe principalmente a la recombinación de:
1. Epítopos.
2. Cadenas ligeras.
3. Cadenas pesadas.
4. Exones.
5. Intrones.

Respuesta correcta: 4. Exones.